Clinical trial inclusion criterion:
Have had >4 emergency department visits within 12 months for 2 consecutive 12-month periods. Period of time can be extended by up to 6 months if incarcerated or institutionalized for ≥ 6 months.

Annotated entities:
- Multiplier: ">4"
- Visit: "emergency department visits"
- Temporal: "within 12 months"
- Temporal: "12-month periods"
- Multiplier: "2 consecutive"
- Person: "incarcerated"
- Person: "institutionalized"
- Temporal: "extended by up to 6 months"